下列何者行經於腰薦神經幹與第一薦神經之間，再經由坐骨大孔到臀部？
A. 髂腰動脈（iliolumbar artery）
B. 臀上動脈（superior gluteal artery）
C. 臀下動脈（inferior gluteal artery）
D. 內陰部動脈（internal pudendal artery）

正確答案：B. 臀上動脈（superior gluteal artery）